¿Qué sustancia se libera tras una hemorragia y provoca un aumento de la reabsorción renal de Na+?:
1. Aldosterona.
2. Angiotensina I.
3. Angiotensinógeno.
4. Vasopresina.

Respuesta correcta: 1. Aldosterona.